ASA I-III

The above is a clinical trial inclusion criterion. Annotated with entity spans:
[Measurement: ASA] [Value: I-III]